2. Diagnosis of venous leg ulcer(s), as clinically determined by the investigator by a positive venous reflux test (venous refilling <20 seconds) using Doppler ultrasound for at least 4 weeks prior to screening day, which have not adequately responded to conventional ulcer therapy.

The above is a clinical trial inclusion criterion. Annotated with entity spans:
[Parsing_Error: 2.] Diagnosis of [Condition: venous leg ulcer(s)], as clinically determined by the investigator by a [Value: positive] [Measurement: venous reflux test] ([Measurement: venous refilling] [Value: <20 seconds]) using [Procedure: Doppler ultrasound] for [Temporal: at least 4 weeks prior to screening day], which have [Negation: not] [Qualifier: adequately] [Observation: responded] to [Procedure: conventional ulcer therapy].